食道鱗狀細胞癌，最少見有以下何種基因的突變或放大情形？
A. k-ras
B. p53
C. p16INK4
D. CYCLIN D1

正確答案：A. k-ras